Hemoglobin concentration under 6.5 mmol/l screening

The above is a clinical trial exclusion criterion. Annotated with entity spans:
[Measurement: Hemoglobin concentration] [Value: under 6.5 mmol/l] screening